Clinical trial exclusion criterion:
• Disease-modifying anti-rheumatic drugs (30 days off drug)

Annotated entities:
- Drug: "Disease-modifying anti-rheumatic drugs"
- Temporal: "30 days off drug"